Clinical trial exclusion criterion:
Pregnancy or lactation

Annotated entities:
- Condition: "Pregnancy"
- Condition: "lactation"